Breastfeeding;

The above is a clinical trial exclusion criterion. Annotated with entity spans:
[Observation: Breastfeeding];